下列何種人體寄生蟲可因入侵生殖系統進入腹腔（peritoneal cavity）而導致慢性骨盆腔腹膜炎（chronic  pelvic peritonitis）？
A. 蟯蟲（Enterobius vermicularis）
B. 鞭蟲（Trichuris trichiura）
C. 旋毛蟲（Trichinella spiralis）
D. 蛔蟲（Ascaris lumbricoides）

正確答案：A. 蟯蟲（Enterobius vermicularis）